Clinical trial exclusion criterion:
Need for long-term oral anticoagulation;

Annotated entities:
- Mood: "Need for"
- Procedure: "long-term oral anticoagulation"